一位 25 歲，性生活活躍的女性來門診求診，主訴有陰道分泌物，子宮頸抹片發現裏面有許多子宮頸的鱗狀上皮細胞，這些細胞的細胞核內有包涵體（intranuclear inclusions）。則最可能的診斷為何？
A. 念珠菌感染（Candida infection）
B. 單	純	疱	疹	病	毒	感	染 （Herpes simplex virus infection）
C. 毛滴蟲感染（Trichomonas infection）
D. 淋菌性感染（Gonococcal infection）

正確答案：B. 單	純	疱	疹	病	毒	感	染 （Herpes simplex virus infection）